current or regular use of psychiatric medications such as tranquilizers, antipsychotics, and/or antidepressants

The above is a clinical trial exclusion criterion. Annotated with entity spans:
current or regular use of [Drug: psychiatric medications] such as [Drug: tranquilizers], [Drug: antipsychotics], and/or [Drug: antidepressants]